Clinical trial inclusion criterion:
Informed consent signed

Annotated entities:
- Non-query-able: "Informed consent signed"